Clinical trial exclusion criterion:
Patients with myasthenia gravis or systemic lupus erythematosus

Annotated entities:
- Condition: "myasthenia gravis"
- Condition: "systemic lupus erythematosus"